En la cromatografía con fluídos supercríticos, la fase móvil que se utiliza de forma habitual es:
1. Hidrógeno.
2. Dióxido de carbono.
3. Nitrógeno.
4. Hexano.

Respuesta correcta: 2. Dióxido de carbono.